醛固酮（aldosterone）主要是從腎上腺的何處分泌？
A. 絲球帶（zona glomerulosa）
B. 囊狀帶（zona fasciculata）
C. 網狀帶（zona reticularis）
D. 髓質（medulla）

正確答案：A. 絲球帶（zona glomerulosa）